Severe renal impairment creatinine clearance (CrCl), i.e. < 30 mL/min.

The above is a clinical trial exclusion criterion. Annotated with entity spans:
[Qualifier: Severe] [Condition: renal impairment] [Measurement: creatinine clearance] ([Measurement: CrCl]), i.e. [Value: < 30 mL/min].